Patients with splenectomy

The above is a clinical trial exclusion criterion. Annotated with entity spans:
Patients with [Procedure: splenectomy]